一位 80 歲老翁，在肢端長滿了鼓脹水泡，病理下螢光免疫檢查發現IgG, C3線狀堆積在基底膜（ basement membrane zone）。該疾患最可能是下列何種水泡病？
A. bullous pemphigoid
B. pemphigus vulgaris
C. Stevens-Johnson syndrome
D. bullous drug eruptions

正確答案：A. bullous pemphigoid